下列關於在急診室內，急性癲癇發作的處置，何者最正確？
A. 即使是單一短暫的發作過後，只要病人尚未清醒就須立即用藥
B. 若有癲癇與用藥病史就只需測藥物濃度，不需血球數、血糖、電解質等檢查
C. 若至急診前有連續的癲癇發作，就必須立刻做腦部影像檢查
D. 首次癲癇並有局部發作的特徵，若血球數、血糖、電解質等全部正常時就需要腦部影像檢查

正確答案：D. 首次癲癇並有局部發作的特徵，若血球數、血糖、電解質等全部正常時就需要腦部影像檢查